Life expectancy ≥ 3 months

The above is a clinical trial inclusion criterion. Annotated with entity spans:
[Measurement: Life expectancy] [Value: ≥ 3 months]